Clinical trial exclusion criterion:
Past history of hypersensitivity to the study drug;

Annotated entities:
- Condition: "hypersensitivity"
- Drug: "study drug"